有關評估子宮異常造成習慣性流產的敘述，下列何者正確？
A. 中膈子宮（septate uterus）為最常見與習慣性流產有關的先天性穆勒氏管異常
B. 穆勒氏管異常常伴隨泌尿道異常，特別是婦女有中膈子宮異常時
C. 漿膜下（subserous）子宮肌瘤，常與習慣性流產有關
D. Kallmann's syndrome 造成的子宮內病變，與習慣性流產有關

正確答案：A. 中膈子宮（septate uterus）為最常見與習慣性流產有關的先天性穆勒氏管異常